Clinical trial inclusion criterion:
Documented history of chronic HCV RNA infection with Genotype 1

Annotated entities:
- Condition: "chronic HCV infection"
- Qualifier: "Genotype 1"